Clinical trial exclusion criterion:
taking any prescription pain/ insulin medication

Annotated entities:
- Drug: "prescription insulin medication"
- Drug: "prescription pain medication"